Clinical trial exclusion criterion:
Diagnoses of mental retardation, dementia or delirium

Annotated entities:
- Condition: "mental retardation"
- Condition: "dementia"
- Condition: "delirium"